難產（dystocia）的發生，與下列何條件無關？
A. powers（uterine contractility and expulsive effort）
B. passenger（fetus）
C. passage（pelvis）
D. Pitocin augmentation

正確答案：D. Pitocin augmentation